How does PRDM9 recognize the specific DNA motifs for meiotic recombination?

The long zinc finger domain of PRDM9 forms a highly stable and long-lived complex with its DNA recognition sequence.